Clinical trial exclusion criterion:
Medical or psychiatric conditions comprising informed consent.

Annotated entities:
- Condition: "psychiatric conditions"
- Undefined_semantics: "psychiatric conditions"
- Condition: "Medical conditions"
- Subjective_judgement: "Medical or psychiatric conditions comprising informed consent"
- Non-query-able: "Medical or psychiatric conditions comprising informed consent"